Clinical trial exclusion criterion:
Recent stroke or heart attack.

Entity relations:
- Has_temporal("stroke", "Recent")
- OR("stroke", "heart attack")